一位肺臟移植病患在門診的例行性抽血檢查中，發現其血中之巨細胞病毒（cytomegalovirus）抗體指數劇增，且病患出現呼吸急促之主訴；在疑似巨細胞病毒感染的診斷下，入院接受治療。請問下列敘述何者有誤？
A. 巨細胞病毒除了感染移植肺部外，也易感染病患的 retina，引起 retinitis，影響病患之視力
B. 靜脈注射 ganciclovir 可有效地治療巨細胞病毒感染，通常只需一星期的療程即可痊癒出院
C. 使用 ganciclovir 治療巨細胞病毒感染，最常見之併發症為 leukopenia
D. 巨細胞病毒感染常常容易復發，因此病患出院後須定期偵測其血中之巨細胞病毒抗體指數

正確答案：B. 靜脈注射 ganciclovir 可有效地治療巨細胞病毒感染，通常只需一星期的療程即可痊癒出院